Clinical trial exclusion criteria:
Chronic HCV Infection with Genotype 2 or 3
Amiodarone. Subjects previously treated with amiodarone must have stopped the amiodarone at least 60 days prior to day 1 of SOF/LDV FDC
Carbamazepine, phenytoin, phenobarbital, oxcarbazepine
Rifabutin, rifampin or rifapentine
HIV regimens containing tenofovir or tipranavir/ritonavir
St. John's wort
Rosuvastatin
Have any serious or active medical or psychiatric illness which, in the opinion of the investigator, would interfere with subject treatment, assessment, or compliance
History of hepatic encephalopathy or variceal hemorrhage
Hepatitis B surface antigen positive
Hemoglobin (Hb) < 8 g/dL
Platelets = 50,000/mm3
alanine aminotransferase (ALT), aspartase aminotransferase (AST), or alkaline phosphatase = 10 times upper limit of normal(ULN)
Total bilirubin > 3 mg/dl
Severe renal impairment creatinine clearance (CrCl), i.e. < 30 mL/min.
History of major organ transplantation with an existing functional graft.
History of clinically-significant drug allergy to nucleoside/nucleotide analogs.
Pregnant women or women planning to become pregnant
Women who are breastfeeding
Active or recent history (= 1 year) of drug or alcohol abuse

Annotated entities:
- Condition: "Chronic HCV Infection"
- Qualifier: "Genotype 2"
- Qualifier: "Genotype 3"
- Drug: "Amiodarone"
- Temporal: "at least 60 days prior to day 1 of SOF/LDV FDC"
- Reference_point: "day 1 of SOF/LDV FDC"
- Non-query-able: "Subjects previously treated with amiodarone must have stopped the amiodarone"
- Drug: "Carbamazepine"
- Drug: "phenytoin"
- Drug: "phenobarbital"
- Drug: "oxcarbazepine"
- Drug: "Rifabutin"
- Drug: "rifampin"
- Drug: "rifapentine"
- Non-query-able: "HIV regimens"
- Drug: "tenofovir"
- Drug: "tipranavir/ritonavir"
- Condition: "St. John's wort"
- Drug: "Rosuvastatin"
- Subjective_judgement: "Have any serious or active medical or psychiatric illness which, in the opinion of the investigator, would interfere with subject treatment, assessment, or compliance"
- Condition: "hepatic encephalopathy"
- Condition: "variceal hemorrhage"
- Measurement: "Hepatitis B surface antigen"
- Value: "positive"
- Measurement: "Hemoglobin"
- Measurement: "Hb"
- Value: "< 8 g/dL"
- Measurement: "Platelets"
- Value: "= 50,000/mm3"
- Measurement: "alanine aminotransferase"
- Measurement: "ALT"
- Measurement: "aspartase aminotransferase"
- Measurement: "AST"
- Measurement: "alkaline phosphatase"
- Value: "= 10 times upper limit of normal"
- Measurement: "Total bilirubin"
- Value: "> 3 mg/dl"
- Condition: "renal impairment"
- Qualifier: "Severe"
- Measurement: "creatinine clearance"
- Measurement: "CrCl"
- Value: "< 30 mL/min"
- Condition: "major organ transplantation"
- Qualifier: "existing functional graft"
- Condition: "drug allergy"
- Qualifier: "clinically-significant"
- Drug: "nucleoside"
- Drug: "nucleotide analogs"
- Pregnancy_considerations: "Pregnant women or women planning to become pregnant"
- Pregnancy_considerations: "Women who are breastfeeding"
- Observation: "alcohol abuse"
- Observation: "drug abuse"
- Temporal: "= 1 year"